Deglutition's problems

The above is a clinical trial exclusion criterion. Annotated with entity spans:
[Condition: Deglutition's problems]